Clinical trial exclusion criterion:
Systemic neuromuscular disease known to affect the lower urinary tract

Annotated entities:
- Condition: "neuromuscular disease"